Men and women aged > 18 years

The above is a clinical trial inclusion criterion. Annotated with entity spans:
[Person: Men] and [Person: women] [Person: aged] [Value: > 18 years]